Contraindications for Lactobacillus Vaginal Suppositories(those without sexual history)

The above is a clinical trial exclusion criterion. Annotated with entity spans:
[Condition: Contraindications] for [Drug: Lactobacillus Vaginal Suppositories](those [Negation: without] [Temporal: sexual history])